liver dysfunction with a factor of at least 3 above the upper limit of normal in AST and ALT levels

The above is a clinical trial exclusion criterion. Annotated with entity spans:
[Condition: liver dysfunction] with a [Value: factor of at least 3 above the upper limit of normal] in [Measurement: AST] and [Measurement: ALT levels]